patient with a history of hypersensitivity to colistin

The above is a clinical trial exclusion criterion. Annotated with entity spans:
patient with a [Temporal: history of] [Condition: hypersensitivity] to [Drug: colistin]